Clinical trial exclusion criterion:
Allergy, or have experienced any drug reaction to ketamine

Entity relations:
- AND("Allergy", "ketamine")
- OR("Allergy", "drug reaction")